下列何者不是穩定蛋白質三級結構的非共價交互作用力？
A. 氫鍵（hydrogen bond）
B. 凡德瓦爾力（van der Waals interaction）
C. 離子交互作用（ionic interaction）
D. 雙硫鍵（disulfide bond）

正確答案：D. 雙硫鍵（disulfide bond）